No change in active cardiac medications for 4 weeks prior to randomization

The above is a clinical trial inclusion criterion. Annotated with entity spans:
[Negation: No] [Qualifier: change] in active [Drug: cardiac medications] [Temporal: for 4 weeks prior to randomization]